Clinical trial inclusion criterion:
Stable motor recovery

Entity relations:
- Has_qualifier("motor recovery", "Stable")